De las siguientes enfermedades evitables con vacunas, ¿cuál es la que ha sido posible erradicar en todo el mundo?:
1. La poliomielitis paralítica.
2. La difteria.
3. La viruela.
4. El sarampión.

Respuesta correcta: 3. La viruela.